Clinical trial inclusion criterion:
Provide written informed consent before beginning any study related activities

Entity relations:
- Has_index("before beginning any study related activities", "any study related activities")
- Has_temporal("written informed consent", "before beginning any study related activities")